Clinical trial inclusion criterion:
55 years of age or older at time of randomization;

Entity relations:
- Has_value("age", "55 years or older")
- Has_temporal("age", "at time of randomization")